Clinical trial inclusion criterion:
Available for follow-up for the planned duration of the study

Annotated entities:
- Post-eligibility: "Available for follow-up for the planned duration of the study"